Clinical trial exclusion criterion:
anyone seriously ill

Annotated entities:
- Condition: "seriously ill"